The participant has received transcranial magnetic stimulation within 6 months.The participant has received selegiline, pethidine, tramadol, reserpine or methyldopa within 90 days.

The above is a clinical trial exclusion criterion. Annotated with entity spans:
[Parsing_Error: The participant has received transcranial magnetic stimulation within 6 months.The participant has received selegiline, pethidine, tramadol, reserpine or methyldopa within 90 days.]